Clinical trial inclusion criterion:
Agree to participate this study

Annotated entities:
- Post-eligibility: "Agree to participate this study"